Clinical trial exclusion criterion:
Any history of receiving GLP-1 analogues or dipeptidyl peptidase inhibitors within 6 months

Annotated entities:
- Drug: "GLP-1 analogues"
- Drug: "dipeptidyl peptidase inhibitors"
- Temporal: "within 6 months"